Clinical trial exclusion criterion:
Patient with contra-indication to: dipyridamole, aminophylline, dobutamine or exercise stress test (depending on the method of cardiovascular stress test chosen)

Annotated entities:
- Condition: "contra-indication"
- Drug: "dipyridamole"
- Drug: "aminophylline"
- Drug: "dobutamine"
- Procedure: "exercise stress test"